Clinical trial exclusion criterion:
Signs and/or symptoms of ocular inflammation/infection (bacterial, viral, fungal, caused by Chlamydia, by Mycobacterium, Acanthamoeba or of allergic etiology).

Annotated entities:
- Condition: "ocular inflammation"
- Condition: "ocular infection"
- Qualifier: "bacterial etiology"
- Qualifier: "viral etiology"
- Qualifier: "fungal etiology"
- Observation: "Chlamydia"
- Observation: "Mycobacterium"
- Observation: "Acanthamoeba"
- Condition: "allergic etiology"
- Qualifier: "caused by Chlamydia"
- Qualifier: "caused by Mycobacterium"
- Qualifier: "caused by Acanthamoeba"